一位媽媽來求診，述說她的小孩從小能看到東西卻不會分辨顏色，其最可能的原因是：
A. 桿狀細胞（rod cells）受損
B. 錐狀細胞（cone cells）上 cGMP 控制型離子通道（cGMP-gated channel）的 α 次單元發生失去功能
C. 此病是因為細胞對光刺激時，Mg2+無法進入細胞所造成
D. 補充維生素 A（vitamin A）便會痊癒

正確答案：B. 錐狀細胞（cone cells）上 cGMP 控制型離子通道（cGMP-gated channel）的 α 次單元發生失去功能